Patient either: refuses surgical treatment OR is contraindicated for surgical treatment

The above is a clinical trial inclusion criterion. Annotated with entity spans:
Patient either: [Condition: refuses surgical treatment] OR is [Condition: contraindicated for surgical treatment]